Clinical trial exclusion criterion:
Use of prescription medications on a regular basis. The last use of any prescription medication must have been greater than 5 half-lives for the specific medication or at least 14 days prior to admission (Day -1), whichever is longer. Hormonal contraception is allowed for female subjects.

Entity relations:
- Has_index("at least 14 days prior to admission", "admission")
- Has_temporal("prescription medications", "regular basis")
- Has_temporal("any prescription medication", "last use greater than 5 half-lives")
- AND("female", "Hormonal contraception")
- OR("last use greater than 5 half-lives", "at least 14 days prior to admission")